Patients for whom endoscopic techniques are contraindicated

The above is a clinical trial exclusion criterion. Annotated with entity spans:
Patients for whom [Procedure: endoscopic techniques] are [Condition: contraindicated]